Clinical trial inclusion criteria:
The group of patients who participated in the study included adults aged at least 19 years among the atraumatic CA outpatients who came to the ER and received CPR.

Annotated entities:
- Person: "adults"
- Person: "aged"
- Value: "at least 19 years"
- Condition: "atraumatic CA"
- Visit: "outpatients"
- Visit: "ER"
- Procedure: "CPR"